Clinical trial exclusion criterion:
4. Left ventricular ejection fraction less than 20%.

Entity relations:
- Has_value("Left ventricular ejection fraction", "less than 20%")